Clinical trial exclusion criterion:
Convulsions, except the ones caused by fever, before 2 years old;

Entity relations:
- Has_negation("caused by fever", "except")
- Has_temporal("Convulsions", "before 2 years old")
- Has_qualifier("Convulsions", "caused by fever")
- Has_index("before 2 years old", "2 years old")